Clinical trial inclusion criterion:
histologically confirmed metastatic cancer that is not amenable to surgery or radiation therapy with curative intent

Entity relations:
- Has_value("histologically", "confirmed")
- AND("metastatic cancer", "histologically")
- Has_qualifier("surgery", "not amenable")
- Has_qualifier("radiation therapy", "not amenable")
- AND("metastatic cancer", "surgery")
- OR("surgery", "radiation therapy")